Intradermal reaction to Tuberculin (PPD skin test) or Mycobacterium tuberculosis antigenspecific interferon-gamma release assay (IGRA)

The above is a clinical trial inclusion criterion. Annotated with entity spans:
[Procedure: Intradermal reaction to Tuberculin (PPD skin test)] or [Procedure: Mycobacterium tuberculosis antigenspecific interferon-gamma release assay (IGRA)]